Clinical trial exclusion criterion:
Multiple pain sources and multifactorial pain sources that complicated or confound diagnosing the SI joint as the primary and predominant pain generator that may contribute to low back pain (including but not limited to: lumbar diagnosis, lumbar radiculopathy, intra or extra-articular hip pathology to include acetabulum and femoral head, lumbo-sacral joint pathology, intervertebral disk disease, spondylolisthesis/spondylosis/spondylolysis of lumbar vertebra)

Entity relations:
- Subsumes("intra -articular hip pathology", "acetabulum pathology")
- Subsumes("Multiple pain sources", "lumbar diagnosis")
- OR("Multiple pain sources", "multifactorial pain sources")
- OR("intra -articular hip pathology", "extra-articular hip pathology")
- OR("acetabulum pathology", "spondylosis", "spondylolisthesis", "intervertebral disk disease", "femoral head pathology", "spondylolysis of lumbar vertebra")
- OR("lumbar diagnosis", "lumbar radiculopathy", "intra -articular hip pathology")